下列那一種鎮靜安眠藥物的半衰期最短？
A. alprazolam
B. triazolam
C. quazepam
D. diazepam

正確答案：B. triazolam